Clinical trial inclusion criterion:
Subject has bone abnormalities preventing safe screw fixation.

Entity relations:
- Has_qualifier("screw fixation", "safe")
- Has_negation("screw fixation", "preventing")
- AND("bone abnormalities", "screw fixation")